submucosal leiomyoma,

The above is a clinical trial exclusion criterion. Annotated with entity spans:
[Condition: submucosal leiomyoma],